Clinical trial inclusion criterion:
Male or Female.

Annotated entities:
- Person: "Male"
- Person: "Female"